What percentage of patients of nasopharyngeal carcinoma (NPC) develop recurrent disease?

1.04% of patients with nasopharyngeal carcinoma develop recurrent disease. The overall recurrence rate is 75%.